Clinical trial exclusion criterion:
6. Modafinil

Annotated entities:
- Parsing_Error: "6."
- Drug: "Modafinil"